1. Justifications: the risk of TMS for individuals with a heart condition is unknown.

The above is a clinical trial exclusion criterion. Annotated with entity spans:
[Parsing_Error: 1.] [Parsing_Error: Justifications: the risk of TMS for individuals with a heart condition is unknown.]